Clinical trial inclusion criterion:
1. Males and females age ≥18 years in second relapse or refractory.

Entity relations:
- Has_multiplier("relapse", "second")
- Has_value("age", "≥18 years")
- OR("relapse", "refractory")
- OR("Males", "females")